Clinical trial exclusion criterion:
Chronic cardiovascular/pulmonary disease

Annotated entities:
- Condition: "pulmonary disease"
- Condition: "cardiovascular disease"
- Temporal: "Chronic"